signed informed consent.

The above is a clinical trial inclusion criterion. Annotated with entity spans:
[Informed_consent: signed informed consent].